男性之反射性勃起（reflexogenic erection），是指男性外陰部受外感性刺激所引起，其由何者控制？
A. 交感神經系統，源自T11-12下腹神經（hypogastric nerve）
B. 副交感神經系統，源自S2-4骨盆神經（pelvic nerve）
C. 交感神經系統，源自S2-4骨盆神經（pelvic nerve）
D. 副交感神經系統，源自T11-12下腹神經（hypogastric nerve）

正確答案：B. 副交感神經系統，源自S2-4骨盆神經（pelvic nerve）